High blood pressure (=130 mmHg systolic or =85mmHg diastolic), or on medication for treating the condition

The above is a clinical trial inclusion criterion. Annotated with entity spans:
[Condition: High blood pressure] ([Value: =130 mmHg systolic] or [Value: =85mmHg diastolic]), or on [Drug: medication for treating] the condition